下列何種疾病不會合併有低血鎂？
A. Gitelman's 症候群（Gitelman's syndrome）
B. Claudin 16 or 19 突變（Claudin 16 or 19 mutations）
C. 再餵食症候群（Refeeding syndrome）
D. 甲狀腺功能低下（Hypothyroidism）

正確答案：D. 甲狀腺功能低下（Hypothyroidism）